Barrett esophagus 是指食道發生何種變化？
A. 柱狀上皮化生為鱗狀上皮
B. 柱狀上皮化生為移行上皮
C. 鱗狀上皮化生為柱狀上皮
D. 鱗狀上皮化生為移行上皮

正確答案：C. 鱗狀上皮化生為柱狀上皮